Women of child-bearing potential and men must agree to use 2 forms of adequate contraception prior to study entry and for the duration of study participation

The above is a clinical trial inclusion criterion. Annotated with entity spans:
[Person: Women] of [Condition: child-bearing potential] and [Person: men] [Mood: must agree to] use [Multiplier: 2 forms] of [Qualifier: adequate] [Procedure: contraception] [Temporal: prior to study entry] and [Temporal: for the duration of study participation]